Clinical trial exclusion criterion:
CNS or other severe organ manifestation of lupus that necessitate aggressive immunosuppressive therapy on its own.

Entity relations:
- AND("lupus", "immunosuppressive therapy")
- Has_qualifier("lupus", "CNS")
- OR("CNS", "organ manifestation")